Clinical trial inclusion criterion:
Person is walking on level ground in a step over step manner.

Annotated entities:
- Observation: "walking"
- Non-query-able: "Person is walking on level ground in a step over step manner"